Age 18 years-65 years old

The above is a clinical trial inclusion criterion. Annotated with entity spans:
[Person: Age] [Value: 18 years-65 years old]